Clinical trial inclusion criterion:
Diagnosis of dyslipidemia: The existence of a previous clinical diagnostic of dyslipidemia associated with lipid-lowering therapy. It is also considered patients who have an altered analytical, using the following cutoffs: total cholesterol = 200 mg / dl, triglycerides = 180 mg / dl, HDL-cholesterol = 40 mg / dl or LDL-cholesterol = 150 mg / dl. Lipid-lowering treatment and diet, stable in the last month.

Annotated entities:
- Condition: "dyslipidemia"
- Procedure: "lipid-lowering therapy"
- Measurement: "total cholesterol"
- Value: "= 200 mg / dl"
- Measurement: "triglycerides"
- Value: "= 180 mg / dl"
- Measurement: "HDL-cholesterol"
- Value: "= 40 mg / dl"
- Measurement: "LDL-cholesterol"
- Value: "= 150 mg / dl"
- Procedure: "Lipid-lowering treatment"
- Procedure: "Lipid-lowering diet"
- Qualifier: "stable"
- Temporal: "in the last month"
- Condition: "altered analytical"
- Condition: "dyslipidemia"